Clinical trial inclusion criterion:
Body Mass Index (BMI) of 17.5 to 30.5 kg/m2; and a total body weight >50 kg (110 lbs).

Annotated entities:
- Measurement: "Body Mass Index (BMI)"
- Value: "17.5 to 30.5 kg/m2"
- Measurement: "total body weight"
- Value: ">50 kg (110 lbs)"